5. Able to swallow the liquid study drug.

The above is a clinical trial inclusion criterion. Annotated with entity spans:
5. [Non-representable: Able to swallow the liquid study drug.]